Clinical trial inclusion criterion:
Patients undergoing a high tibial osteotomy (HTO)

Annotated entities:
- Procedure: "high tibial osteotomy (HTO)"
- Temporal: "undergoing"